Givosiran is used for treatment of which disease?

Givosiran is approved for treatment of porphyria.